Clinical trial exclusion criterion:
Severe hepatic impairment (eg, ascites and/or clinical signs of coagulopathy)

Entity relations:
- Has_mood("coagulopathy", "clinical signs of")
- Subsumes("Severe hepatic impairment", "ascites")
- OR("ascites", "coagulopathy")